Clinical trial inclusion criterion:
Patients aged greater than 18 years of age

Entity relations:
- Has_value("age", "greater than 18 years")
- Has_value("aged", "greater than 18 years")
- OR("aged", "age")